Una de las técnicas más eficaces que se incluyen en los programas de intervención psicológica para la disfunción orgásmica femenina primaria es:
1. La terapia de vacío.
2. La exposición en imaginación.
3. El entrenamiento del músculo pubocoxígeo.
4. La desensibilización sistemática.
5. La técnica de parada y arranque.

Respuesta correcta: 3. El entrenamiento del músculo pubocoxígeo.